Clinical trial exclusion criterion:
known allergy to administered opioid

Annotated entities:
- Condition: "allergy"
- Drug: "opioid"